Which is the molecular weight of the protein angiogenin?

The molecular weight of angiogenin is 14,120 Da. The bovine angiogenin is 14,595 Da